Approximately how many genes are contained in the X chromosome's non-pseudoautosomal region (non-PAR)?

The number of genes contained in the non- pseudo-autosomal region (PAR) X chromosome is 783.